Clinical trial inclusion criterion:
Provision of voluntary written informed consent

Annotated entities:
- Post-eligibility: "Provision of voluntary written informed consent"